Inability to obtain consent from patient or patients kin

The above is a clinical trial exclusion criterion. Annotated with entity spans:
[Informed_consent: Inability to obtain consent from patient or patients kin]